Clinical trial exclusion criterion:
Congestive heart failure (patients with LVEF <30% or cardiogenic shock)

Annotated entities:
- Condition: "Congestive heart failure"
- Measurement: "LVEF"
- Value: "<30%"
- Condition: "cardiogenic shock"